Clinical trial exclusion criterion:
3. Ongoing pregnancy.

Annotated entities:
- Parsing_Error: "3."
- Condition: "pregnancy"
- Temporal: "Ongoing"